Clinical trial exclusion criterion:
Borderline or Antisocial Personality Disorder.

Annotated entities:
- Condition: "Antisocial Personality Disorder"
- Condition: "Borderline Personality Disorder"